Clinical trial exclusion criterion:
Known hypersensitivity to MTX

Annotated entities:
- Condition: "hypersensitivity to MTX"
- Drug: "MTX"